Age = 18 years.

The above is a clinical trial inclusion criterion. Annotated with entity spans:
[Person: Age] [Value: = 18 years].